7. Evidence of significant hepatic, hematologic, or immunologic impairment.

The above is a clinical trial exclusion criterion. Annotated with entity spans:
7. Evidence of significant [Condition: hepatic], [Condition: hematologic], or [Condition: immunologic impairment].